14 歲少女，6 個月前來第一次月經。急性右下腹痛求診，懷疑：盲腸炎、排卵痛（Mittelschmerz）、卵巢囊腫扭轉、骨盆腔炎或子宮內膜異位症。下列那項最優先檢查且有助於鑑別診斷？
A. 腹腔鏡手術（Laparoscopy）
B. 腹部電腦斷層檢查（CT）
C. 骨盆超音波檢查（Sonography）
D. 核磁共振檢查（MRI）

正確答案：C. 骨盆超音波檢查（Sonography）